Clinical trial exclusion criterion:
Are in renal failure (Creatinine clearance <15 mL/min), have NYHA Functional class IV heart failure, or a systemic illness likely to limit survival to <1 year

Annotated entities:
- Condition: "renal failure"
- Measurement: "Creatinine clearance"
- Value: "<15 mL/min"
- Measurement: "NYHA Functional class"
- Value: "IV"
- Condition: "heart failure"
- Condition: "systemic illness"
- Observation: "survival"
- Value: "<1 year"